Clinical trial inclusion criteria:
Age = 19 and = 70 years;
Presence of liver cirrhosis
Serum albumin level = 3.5g/dl, ultrasound or CT scan confirmed ascites (=Grade 1)
No administration of diuretics and BCAA within the past 1 week
Voluntary consent to take part in this trial

Annotated entities:
- Person: "Age"
- Value: "= 19 and = 70 years"
- Condition: "liver cirrhosis"
- Measurement: "Serum albumin"
- Value: "= 3.5g/dl"
- Procedure: "ultrasound"
- Procedure: "CT scan"
- Condition: "ascites"
- Qualifier: "Grade 1"
- Negation: "No"
- Drug: "diuretics"
- Drug: "BCAA"
- Temporal: "past 1 week"
- Informed_consent: "Voluntary consent to take part in this trial"